一位 3 個月大男嬰的血清中，有兩個化合物的濃度較高，包括苯丙胺酸（phenylalanine）與苯丙酮酸 （phenylpyruvate），懷疑是苯酮尿症（phenylketonuria），但檢驗測得的苯丙胺酸羥化酶（Phenylalanine 
 hydroxylase）活性卻正常。若下列那個酵素檢驗項目異常，仍可以支持你的苯酮尿症診斷？
A. 酪胺酸酶（tyrosinase）
B. 雙氫喋啶還原酵素（dihydrobiopterin reductase）
C. 黑尿酸氧化酶（homogentisic acid oxidase）
D. 多巴胺羥化酶（dopamine hydroxylase）

正確答案：B. 雙氫喋啶還原酵素（dihydrobiopterin reductase）